Clinical trial exclusion criterion:
Acquired thrombophilia.

Entity relations:
- Has_qualifier("thrombophilia", "Acquired")